Use of any investigational or non-registered product (drug or vaccine) other than the study vaccine(s) within 30 days preceding the first dose of study vaccine, or planned use during the study period

The above is a clinical trial exclusion criterion. Annotated with entity spans:
Use of any investigational or [Drug: non-registered product] ([Drug: drug] or [Drug: vaccine]) other than the study vaccine(s) [Temporal: within 30 days] preceding the first dose of study vaccine, or [Mood: planned use] [Temporal: during the study period]